Clinical trial exclusion criterion:
Life expectancy less than 2 years

Entity relations:
- Has_value("Life expectancy", "less than 2 years")